Asthma;

The above is a clinical trial exclusion criterion. Annotated with entity spans:
[Condition: Asthma];